Clinical trial exclusion criterion:
Is currently participating in or has participated in an interventional clinical trial with an investigational compound or device within 30 days of signing the informed consent/assent for this current trial.

Annotated entities:
- Observation: "has participated in an interventional clinical trial"
- Observation: "currently participating in an interventional clinical trial"
- Drug: "investigational compound"
- Device: "device"
- Temporal: "within 30 days of signing the informed consent"
- Reference_point: "signing the informed consent"
- Temporal: "within 30 days of signing the informed assent"
- Reference_point: "signing the informed assent"